Clinical trial exclusion criterion:
Screening tool: TMS adult safety questionnaire, Medical History.

Annotated entities:
- Procedure: "TMS adult safety questionnaire"
- Temporal: "Medical History"
- Procedure: "Screening"